以下何者是腦靜脈竇栓塞（cerebral venous sinus thrombosis）最常見的臨床表現？
A. 複視
B. 頭痛
C. 單側肢體無力
D. 意識障礙

正確答案：B. 頭痛